Pain at rest or critical limb ischemia

The above is a clinical trial exclusion criterion. Annotated with entity spans:
[Condition: Pain at rest] or [Condition: critical limb ischemia]